Clinical trial exclusion criterion:
Diagnosed with secondary hypertension or suspected of secondary hypertension [e.g., renovascular disease, adrenal medullary and cortical hyperfunction, coarctation of the aorta, hyperaldosteronism, unilateral or bilateral renal artery stenosis, Cushing's syndrome, pheochromocytoma, polycystic kidney disease, etc.]

Annotated entities:
- Condition: "hypertension"
- Qualifier: "secondary"
- Mood: "suspected"
- Qualifier: "secondary"
- Condition: "hypertension"
- Condition: "renovascular disease"
- Condition: "adrenal medullary hyperfunction"
- Condition: "cortical hyperfunction"
- Condition: "coarctation of the aorta"
- Condition: "hyperaldosteronism"
- Qualifier: "unilateral"
- Qualifier: "bilateral"
- Condition: "renal artery stenosis"
- Condition: "Cushing's syndrome"
- Condition: "pheochromocytoma"
- Condition: "polycystic kidney disease"